Clinical trial exclusion criterion:
Pregnant woman with infection of human immunodeficiency virus or hepatitis C virus

Annotated entities:
- Condition: "Pregnant"
- Person: "woman"
- Condition: "human immunodeficiency virus"
- Condition: "hepatitis C virus"